Clinical trial exclusion criteria:
Teeth with clinical symptoms of irriversible pulpitis or pulp necrosis or acute dental infection
Children with systemic illness that contraindicated vital pulp treatment such a sickle cell disease
Teeth that are not restorable

Annotated entities:
- Condition: "irriversible pulpitis"
- Condition: "pulp necrosis"
- Condition: "acute dental infection"
- Qualifier: "Teeth"
- Condition: "systemic illness"
- Condition: "contraindicated"
- Procedure: "vital pulp treatment"
- Condition: "sickle cell disease"
- Observation: "Teeth that are not restorable"